Absolute neutrophil count (ANC) >1,500/microL and platelets >100,000/microL (≤72 hours prior to initial treatment).

The above is a clinical trial inclusion criterion. Annotated with entity spans:
[Measurement: Absolute neutrophil count (ANC)] [Value: >1,500/microL] and [Measurement: platelets] [Value: >100,000/microL] ([Temporal: ≤72 hours prior to initial treatment]).